congenital heart disease

The above is a clinical trial exclusion criterion. Annotated with entity spans:
[Condition: congenital heart disease]